Clinical trial exclusion criterion:
Significant heart disease (chronic congestive heart failure, symptomatic coronary disease) or myocardial infarction in the previous 6 months

Annotated entities:
- Condition: "heart disease"
- Qualifier: "Significant"
- Condition: "chronic congestive heart failure"
- Condition: "symptomatic coronary disease"
- Condition: "myocardial infarction"
- Temporal: "in the previous 6 months"